• Human leukocyte antigen B27 (HLA-B27)+ gene

The above is a clinical trial inclusion criterion. Annotated with entity spans:
• Human leukocyte antigen B27 [Condition: (HLA-B27)+] [Condition: gene]